Una de las siguientes afirmaciones es falsa en relación a los efectos farmacológicos de la hormona del crecimiento:
1. Actúa directamente sobre los adipocitos para incrementar la lipogénesis.
2. Estimula el crecimiento longitudinal de los huesos.
3. Tiene acciones antiinsulínicas en el hígado.
4. Incrementa la masa muscular.
5. Muchos efectos de la hormona del crecimiento se debe al factor 1 de crecimiento similar a la insulina (IGF-1).

Respuesta correcta: 1. Actúa directamente sobre los adipocitos para incrementar la lipogénesis.